Clinical trial exclusion criterion:
All cases were a 'full stomach' is suspected (gastric banding)

Annotated entities:
- Non-representable: "All cases were a 'full stomach' is suspected (gastric banding)"